Clinical trial exclusion criterion:
Has a neuromuscular disorder that may affect NMB and/or trial assessments.

Annotated entities:
- Condition: "neuromuscular disorder"
- Observation: "affect NMB"
- Observation: "affect trial assessments"